What is the function of the YY1 transcriptional regulator?

YY1 is a transcriptional regulator. It is a protein that binds to the C-fos promoter. The function of this protein is to bend DNA to allow it to contact with other proteins.